Clinical trial exclusion criterion:
2. Past or current history of neoplasm other than the entry diagnosis, with the exception of treated non-melanoma skin cancer or carcinoma in-situ of any primary site, or invasive cancers treated definitively, with treatment ending >5 years previously and no evidence of recurrences.

Annotated entities:
- Condition: "neoplasm"
- Condition: "non-melanoma skin cancer"
- Procedure: "treated"
- Qualifier: "treated"
- Condition: "carcinoma in-situ"
- Condition: "cancers"
- Qualifier: "invasive"
- Qualifier: "treated definitively"
- Procedure: "treated"
- Negation: "with the exception of"
- Temporal: ">5 years previously"
- Observation: "evidence of recurrences"
- Negation: "no"
- Temporal: "history"
- Temporal: "current"
- Temporal: "Past"
- Qualifier: "other than the entry diagnosis"
- Condition: "entry diagnosis"